Clinical trial exclusion criterion:
Metabolic or hormonal abnormalities

Entity relations:
- OR("Metabolic abnormalities", "hormonal abnormalities")